一位72歲輕度失智老人，其認知障礙是漸進發生而逐漸惡化，動作緩慢易跌倒，偶有意識混亂及幻覺，但無尿失禁。理學檢查身體軀幹僵直，無顫抖。電腦斷層掃描顯示大腦泛發性萎縮，腦電圖顯現輕度泛發性皮質功能異常。病人最可能罹患下列何種病？
A. 路易體失智症（dementia with Lewy body）
B. 阿茲海默症（Alzheimer's disease）
C. 常壓性水腦症（normal pressure hydrocephalus）
D. 庫賈氏症（Creutzfeldt-Jakob disease）

正確答案：A. 路易體失智症（dementia with Lewy body）